Clinical trial exclusion criteria:
Unable to consent
Chronic opioid consumption
Allergy to study medication
Lower limb surgery preceding year
Unable to complete baseline testing, pre-existing neurological deficit
Contraindication to spinal anaesthesia

Annotated entities:
- Post-eligibility: "Unable to consent"
- Condition: "opioid consumption"
- Qualifier: "Chronic"
- Condition: "Allergy"
- Drug: "study medication"
- Procedure: "Lower limb surgery"
- Non-query-able: "Unable to complete baseline testing"
- Condition: "neurological deficit"
- Qualifier: "pre-existing"
- Condition: "Contraindication"
- Procedure: "spinal anaesthesia"